ASIA A,B,C, or D

The above is a clinical trial inclusion criterion. Annotated with entity spans:
[Measurement: ASIA] [Value: A,B,C, or D]